Provides written informed consent

The above is a clinical trial inclusion criterion. Annotated with entity spans:
Provides [Observation: written informed consent]